Si desea estimar los efectos de una intervención empleará:
1. Un diseño transversal.
2. Un diseño retrospectivo.
3. Un estudio ecológico.
4. Un ensayo clínico aleatorizado.
5. Un diseño observacional con selección al azar de los participantes.

Respuesta correcta: 4. Un ensayo clínico aleatorizado.